What kind of enzyme is encoded by the proto-oncogene ABL1?

The Abelson (ABL) family of nonreceptor tyrosine kinases, ABL1 and ABL2, transduces diverse extracellular signals to protein networks that control proliferation, survival, migration and invasion. Constitutively activated mutants of the non-receptor tyrosine kinase (TK) ABL1 (Abelson murine leukemia viral (v-abl) homolog (1) protein) play a central role in the pathogenesis myeloproliferative disorders and in some cases of acute leukemia and lymphoma.